Clinical trial exclusion criterion:
Non-cephalic presentation

Annotated entities:
- Condition: "Non-cephalic presentation"